Clinical trial exclusion criterion:
Cardiogenic shock of patient with KILLIP III or IV

Entity relations:
- Has_value("KILLIP", "III or IV")